在大腸桿菌中，下列何者為利用弱化作用（attenuation）以調控色胺酸操縱子（Trp operon）表現的調控機 制？
A. 弱化機制是調控色胺酸生合成酵素表現的唯一機制
B. 前導肽（leader peptide）直接對RNA聚合酶作用，以弱化色胺酸生合成酵素基因的轉錄表現
C. 前導肽上的色胺酸編碼子（Trp codons）是主要的遺傳設計，可用以偵測細胞中色胺酸的含量
D. 當色胺酸在細胞中的量很低時，會引發色胺酸操縱子的弱化作用

正確答案：C. 前導肽上的色胺酸編碼子（Trp codons）是主要的遺傳設計，可用以偵測細胞中色胺酸的含量